你在急診接到一位 2 歲左脛骨骨折女孩，她身上還存在多處瘀青與疤痕，你懷疑這是兒童虐待個案，但隨行的媽媽堅稱孩子非常調皮，因經常跌倒撞傷所致，你該如何處置？
A. 收集到確實虐待證據就通報
B. 涉及個人隱私，不能通報
C. 再追蹤觀察 2 個月
D. 立即通報相關機構

正確答案：D. 立即通報相關機構